53歲男性，無既往病史。主訴在一海邊漁釣場釣魚時被魚鰭刺及右手掌，之後數週皮膚傷口逐漸惡化形成一 2公分直徑中央有慢性潰瘍之圓形肉芽腫，帶有分泌物。經皮膚切片檢查，病理變化有肉芽腫（granuloma）、 氏巨大細胞（Langhans'giant cells）、且有多量嗜酸性桿菌，而且檢體在分支桿菌培養只在 30°C 培養長出菌。下列何者是最可能致病菌？
A. Mycobacterium abscessus
B. Mycobacterium kansasii
C. Mycobacterium marinum
D. Mycobacterium ulcerans

正確答案：C. Mycobacterium marinum